Clinical trial exclusion criterion:
Meets Diagnostic and Statistical Manual of Mental Disorders, 5th Edition (DSM-5) criteria for any Substance Use Disorder except caffeine-related disorders, or tobacco-related disorders.

Entity relations:
- Has_negation("caffeine-related disorders", "except")
- AND("Substance Use Disorder", "caffeine-related disorders")
- Has_value("Diagnostic and Statistical Manual of Mental Disorders, 5th Edition (DSM-5) criteria", "Meets")
- AND("Substance Use Disorder", "Diagnostic and Statistical Manual of Mental Disorders, 5th Edition (DSM-5) criteria")
- OR("caffeine-related disorders", "tobacco-related disorders")